Cardiovascular disease Clinically relevant ventricular tachycardia or ventricular fibrillation, 3rd degree AV block or Torsades de Pointes or treatment with antiarrhythmic drugs. Percutaneous coronary intervention within the past 6 months. Any of the following within the past 6 months: myocardial infarction (MI), coronary artery bypass surgery; unstable angina; or stroke.

The above is a clinical trial exclusion criterion. Annotated with entity spans:
[Condition: Cardiovascular disease] [Qualifier: Clinically relevant] [Condition: ventricular tachycardia] or [Condition: ventricular fibrillation], [Condition: 3rd degree AV block] or [Condition: Torsades de Pointes] or [Procedure: treatment] with [Drug: antiarrhythmic drugs]. [Procedure: Percutaneous coronary intervention] [Temporal: within the past 6 months]. Any of the following [Temporal: within the past 6 months]: [Condition: myocardial infarction (MI)], [Procedure: coronary artery bypass surgery]; [Condition: unstable angina]; or [Condition: stroke].